10. Within 30 days prior to the index study procedure, the subject has undergone a previous coronary interventional procedure of any kind. Note: This exclusion criterion does not apply to post-STEMI patients.

The above is a clinical trial exclusion criterion. Annotated with entity spans:
10. [Temporal: Within 30 days prior to the index study procedure], the subject has undergone a [Temporal: previous] [Procedure: coronary interventional procedure] of any kind. Note: This exclusion criterion does [Negation: not] apply to post-[Condition: STEMI] patients.